Clinical trial exclusion criterion:
Patients with myasthenia gravis or systemic lupus erythematosus

Entity relations:
- OR("myasthenia gravis", "systemic lupus erythematosus")